關於 pentazocine 的敘述，下列何者錯誤？
A. 高劑量的 pentazocine 會造成血壓的上升
B. 可以與 morphine 併用，以達最大的止痛效果
C. 比 morphine 較不易產生欣快感
D. 口服有效

正確答案：B. 可以與 morphine 併用，以達最大的止痛效果